Clinical trial inclusion criterion:
Patient is either: refractory to medical treatment, contraindicated to medical treatment, OR refuses medical treatment

Entity relations:
- OR("refractory to medical treatment", "contraindicated to medical treatment", "refuses medical treatment")